Clinical trial exclusion criterion:
Head trauma within the previous two weeks

Annotated entities:
- Condition: "Head trauma"
- Temporal: "within the previous two weeks"